Presented for elective gastrointestinal endoscopy

The above is a clinical trial inclusion criterion. Annotated with entity spans:
Presented for [Qualifier: elective] [Procedure: gastrointestinal endoscopy]